Clinical trial exclusion criterion:
Ongoing ocular infection or inflammation in either eye.

Annotated entities:
- Temporal: "Ongoing"
- Condition: "ocular infection"
- Condition: "ocular inflammation"
- Qualifier: "in either eye"